Clinical trial exclusion criterion:
Patients with chronic liver disease

Annotated entities:
- Condition: "chronic liver disease"